Gap junction 常見於下列那些肌肉細胞？
A. single-unit smooth muscle 與 skeletal muscle
B. multi-unit smooth muscle 與 cardiac muscle
C. single-unit smooth muscle 與 cardiac muscle
D. skeletal muscle 與 cardiac muscle

正確答案：C. single-unit smooth muscle 與 cardiac muscle